腺病毒之傳播方式為：
A. 性行為
B. 接觸
C. 輸血
D. 母奶

正確答案：B. 接觸